Clinical trial inclusion criterion:
Taking most recent DMT continuously* for no less than two years.

Annotated entities:
- Drug: "DMT"
- Multiplier: "continuously"
- Temporal: "for no less than two years"